下列何者不是美國麻醉醫學會預防手術中周邊神經受損的建議？
A. 術前確認患者是否可以容忍預期的手術擺位
B. 側躺的病人使用胸捲軸（chest rolls）可以降低神經受損的風險
C. 採碎石姿勢（lithotomy）過度拉扯腿後肌群（hamstring muscle group），會增加股神經受損的風險
D. 手肘屈曲可能會增加尺神經受損的風險

正確答案：C. 採碎石姿勢（lithotomy）過度拉扯腿後肌群（hamstring muscle group），會增加股神經受損的風險